Has bilateral sacroiliitis Grade 2 or unilateral sacroiliitis Grade 3 or Grade 4

The above is a clinical trial exclusion criterion. Annotated with entity spans:
Has [Qualifier: bilateral] [Condition: sacroiliitis] [Qualifier: Grade 2] or [Qualifier: unilateral] [Condition: sacroiliitis] [Qualifier: Grade 3] or [Qualifier: Grade 4]